Clinical trial inclusion criterion:
Baseline DAS28/Erythrocyte Sedimentation Rate (ESR) >=3.2

Annotated entities:
- Temporal: "Baseline"
- Measurement: "DAS28/Erythrocyte Sedimentation Rate (ESR)"
- Value: ">=3.2"